Clinical trial exclusion criteria:
Metastatic tumor
Locally unresectable tumor
Previous gastric resection
ASA IV-V
Age under 18 years
Preoperative complete parenteral or enteral feeding
Immunosuppressive therapy before operation
Severe malnutrition
Lack of the patient's consent for the trial participation, feeding tube insertion or epidural analgesia

Annotated entities:
- Condition: "tumor"
- Qualifier: "Metastatic"
- Qualifier: "Locally unresectable"
- Condition: "tumor"
- Temporal: "Previous"
- Procedure: "gastric resection"
- Measurement: "ASA"
- Value: "IV-V"
- Person: "Age"
- Value: "under 18 years"
- Temporal: "Preoperative"
- Condition: "complete parenteral feeding"
- Condition: "complete enteral feeding"
- Procedure: "Immunosuppressive therapy"
- Temporal: "before operation"
- Procedure: "operation"
- Reference_point: "operation"
- Qualifier: "Severe"
- Condition: "malnutrition"
- Informed_consent: "Lack of the patient's consent for the trial participation, feeding tube insertion or epidural analgesia"